下列有關 Donnan effect 之敘述，何者錯誤？
A. Donnan effect 係指可以通透膜之離子所造成在膜兩側之離子重新分布效應
B. Donnan effect 係指無法通透膜之離子所造成在膜兩側之離子重新分布效應
C. Donnan effect 遵守膜兩側均為維持電中性之最低能量之限制
D. Donnan effect 與滲透度有關

正確答案：A. Donnan effect 係指可以通透膜之離子所造成在膜兩側之離子重新分布效應